Clinical trial exclusion criterion:
Awaiting cardiac transplantation or other cardiac surgery within the next 12 months (365 days)

Annotated entities:
- Procedure: "cardiac transplantation"
- Procedure: "cardiac surgery"
- Temporal: "within the next 12 months"
- Temporal: "within the next 365 days"